Clinical trial inclusion criterion:
2.6mmol/L (100mg/dl)=LDL-C=5.2mmol/L (200mg/dl), and TG<5.7mmol/L (500mg/dl);

Entity relations:
- Subsumes("5.2mmol/L", "200mg/dl")
- Subsumes("2.6mmol/L", "100mg/dl")
- Subsumes("<5.7mmol/L", "500mg/dl")
- Has_value("TG", "<5.7mmol/L")
- Has_value("LDL-C", "2.6mmol/L")
- Has_value("LDL-C", "5.2mmol/L")